Clinical trial exclusion criterion:
Contraindication to spinal anesthesia

Annotated entities:
- Condition: "Contraindication"
- Procedure: "spinal anesthesia"